Clinical trial inclusion criterion:
Toxic epidermal necrolysis with SCORTEN 1 to 5 at admission

Annotated entities:
- Condition: "Toxic epidermal necrolysis"
- Measurement: "SCORTEN"
- Value: "1 to 5"
- Temporal: "at admission"
- Reference_point: "admission"